Clinical trial inclusion criterion:
chronic obstructive pulmonary disease (COPD), GOLD grade 2-3

Entity relations:
- Has_value("GOLD grade", "2-3")
- Subsumes("chronic obstructive pulmonary disease", "COPD")
- AND("chronic obstructive pulmonary disease", "GOLD grade")